Gastric ulcer or duodenal ulcer with clinical manifestations or endoscopically identified acute ulcer without signs of scarring during previous 30 days.

The above is a clinical trial exclusion criterion. Annotated with entity spans:
[Condition: Gastric ulcer] or [Condition: duodenal ulcer] with [Condition: clinical manifestations] or [Qualifier: endoscopically identified] [Condition: acute ulcer] [Negation: without] [Condition: signs of scarring] [Temporal: during previous 30 days].